抗體之效用功能（effector functions）是由下列那一項決定？
A. 輕鏈（light chain）的變異區（variable region）
B. 輕鏈（light chian）的不變區（constant region）
C. 重鏈（heavy chain）的變異區（variable region）
D. 重鏈（heavy chain）的不變區（constant region）

正確答案：D. 重鏈（heavy chain）的不變區（constant region）